Clinical trial exclusion criterion:
Breast implants

Annotated entities:
- Device: "Breast implants"